Clinical trial inclusion criteria:
Age from 40 to 80 years old, either gender;
Patients with bilateral age related cataracts, require bilateral cataract phacoemulsification combined Intraocular Lens implantation;
Willing to undergo second eye surgery within 7 days after first eye surgery;
The potential postoperative visual acuity of 20/40 or better in both eyes;
Preoperative measurement of corneal astigmatism indicate the subjects are suitable for multifocal intraocular lenses implantation;
Capability to understand the informed consent and willing and able to attend study

Annotated entities:
- Person: "Age"
- Value: "from 40 to 80 years old"
- Qualifier: "age related"
- Condition: "cataracts"
- Qualifier: "bilateral"
- Procedure: "cataract phacoemulsification"
- Qualifier: "bilateral"
- Procedure: "Intraocular Lens implantation"
- Non-query-able: "Willing to undergo second eye surgery within 7 days after first eye surgery;"
- Non-query-able: "The potential postoperative visual acuity of 20/40 or better in both eyes;"
- Measurement: "measurement of corneal astigmatism"
- Procedure: "multifocal intraocular lenses implantation"
- Value: "suitable"
- Temporal: "Preoperative"
- Post-eligibility: "Capability to understand the informed consent and willing and able to attend study"